左側中大腦動脈（middle cerebral artery）阻塞，最可能造成下列何種症狀？
A. 左視野缺失
B. 右下肢感覺喪失
C. 右下肢無力
D. 失語症

正確答案：D. 失語症